Clinical trial exclusion criterion:
Positive Hepatitis B surface antigen test

Entity relations:
- Has_value("Hepatitis B surface antigen test", "Positive")